Clinical trial exclusion criterion:
allergic to GLP-1 receptor agonist

Annotated entities:
- Condition: "allergic"
- Drug: "GLP-1 receptor agonist"